關於乳癌的影像檢查包括超音波、乳房攝影及核磁共振，下列敘述何者錯誤？
A. breast imaging reporting and data system（BI-RADS）用以評估惡性可能，其中第一類BI-RADS，代表沒有任何病灶
B. BI-RADS 3代表病灶出現，可能為良性，需短期追蹤
C. BI-RADS 5代表病灶出現，而且已經證實為乳癌
D. 核磁共振（MRI）適用於腋下淋巴乳癌轉移，其原發病灶不明（unknown primary tumor）或佩吉特氏病

正確答案：C. BI-RADS 5代表病灶出現，而且已經證實為乳癌